下列有關脊髓的感覺神經分布之配對，何者正確？
A. T4－腋下
B. T6－乳頭附近
C. T10－肚臍周圍
D. L5－腳踝外側

正確答案：C. T10－肚臍周圍